Clinical trial inclusion criterion:
Scheduled to undergo surgery for primary solid organ cancer under general anesthesia, with an expected duration of surgery >=2 hours;

Entity relations:
- Has_qualifier("solid organ cancer", "primary")
- AND("surgery", "solid organ cancer")
- AND("surgery", "general anesthesia")
- Has_mood("surgery", "Scheduled")